Gout

The above is a clinical trial exclusion criterion. Annotated with entity spans:
[Condition: Gout]